脊椎側彎（scoliosis）在腦性麻痺（cerebral palsy）患者的發生率為21%至76%，若以粗大動作功能評估系 統（Gross Motor Function Classification System, GMFCS）來分類腦性麻痺的嚴重度，下列那種嚴重度的
 腦性麻痺患者有較大的機會產生脊椎側彎的問題？
A. GMFCS I
B. GMFCS II
C. GMFCS III
D. GMFCS IV

正確答案：D. GMFCS IV